Known hypersensitivity to ACE inhibitors

The above is a clinical trial exclusion criterion. Annotated with entity spans:
Known [Condition: hypersensitivity to ACE inhibitors]